下列有關棘狀阿米巴角膜炎（acanthamoeba keratitis）的敘述，何者錯誤？
A. 配戴隱形眼鏡為其主要危險因子
B. 相較於單純疱疹角膜炎（herpes simplex keratitis），病人會有更明顯的眼睛疼痛
C. 角膜典型表現為環狀角膜浸潤（ring-shape infiltration）
D. 及時給與適當的藥物，一般約一星期左右可痊癒而停藥

正確答案：D. 及時給與適當的藥物，一般約一星期左右可痊癒而停藥